clinical data is complete.

The above is a clinical trial inclusion criterion. Annotated with entity spans:
[Non-query-able: clinical data is complete.]